Fasting triglycerides greater than 400 mg/dL.

The above is a clinical trial exclusion criterion. Annotated with entity spans:
[Measurement: Fasting triglycerides] [Value: greater than 400 mg/dL].